急性橫斷性脊髓炎最常出現病變之脊髓位置為何？
A. 頸部
B. 胸部
C. 腰部
D. 薦部

正確答案：B. 胸部